Clinical trial exclusion criterion:
Central venous oxygen saturation (ScvO2) < 60% despite optimization of hematocrit and volume status

Entity relations:
- Has_value("Central venous oxygen saturation (ScvO2)", "< 60%")
- AND("despite", "optimization of hematocrit")
- Has_context("despite", "volume status")
- Has_context("Central venous oxygen saturation (ScvO2)", "despite")